Clinical trial exclusion criterion:
Previous or concurrent malignancy, except for adequately treated basal cell or squamous cell skin cancer, in situ cervical cancer, or any other cancer for which the patient has been previously treated and the lifetime recurrence risk is less than 30%

Annotated entities:
- Condition: "malignancy"
- Qualifier: "Previous"
- Qualifier: "concurrent"
- Negation: "except"
- Condition: "squamous cell skin cancer"
- Condition: "basal cell skin cancer"
- Condition: "cervical cancer"
- Qualifier: "in situ"
- Qualifier: "adequately treated"
- Non-query-able: "any other cancer for which the patient has been previously treated and the lifetime recurrence risk is less than 30%"